Severe physical or psychological concomitant diseases that might impair compliance with the provisions of the study protocol or that might impair the assessment of drug or patient safety, e.g. clinically significant ascites, cardiac failure, NYHA III or IV, clinically relevant pathologic findings in ECG

The above is a clinical trial exclusion criterion. Annotated with entity spans:
Severe [Condition: physical] or [Condition: psychological] concomitant diseases that might impair compliance with the provisions of the study protocol or that might impair the assessment of drug or patient safety, e.g. [Qualifier: clinically significant] [Condition: ascites], [Condition: cardiac failure], [Measurement: NYHA] [Value: III or IV], [Qualifier: clinically relevant] [Observation: pathologic findings] in [Procedure: ECG]